下列有關眼部肌肉之控制，何者錯誤？
A. 上瞼板肌（superior tarsal muscle）由動眼神經（oculomotor nerve）支配
B. 上斜肌（superior oblique muscle）由第四顱神經支配
C. 張開瞼裂（palpebral fissure）之主要控制神經為第三顱神經
D. 閉緊瞼裂（palpebral fissure）之主要控制神經為第七顱神經

正確答案：A. 上瞼板肌（superior tarsal muscle）由動眼神經（oculomotor nerve）支配